Clinical trial exclusion criteria:
Prior treatment with Acthar in the past 2mos
Meet one of the above RA flare requirements
Subjects who have received live or live attenuated vaccines within 6 weeks prior to the first dose of study drug (or the zoster vaccine)

Annotated entities:
- Temporal: "Prior"
- Procedure: "treatment"
- Drug: "Acthar"
- Temporal: "in the past 2mos"
- Condition: "RA flare requirements"
- Multiplier: "one of"
- Drug: "live attenuated vaccines"
- Temporal: "within 6 weeks prior to the first dose of study drug"
- Reference_point: "the first dose of study drug"
- Multiplier: "first dose"
- Drug: "study drug"
- Drug: "zoster vaccine"
- Drug: "live vaccines"